Las enterobacteriaceas son bacterias:
1. Capaces de respirar y de fermentar.
2. Citrocromo C oxidasa positivas.
3. Móviles con flagelación polar.
4. Carentes de lipopolisacárido.
5. Siempre asociadas al intestino de mamíferos.

Respuesta correcta: 1. Capaces de respirar y de fermentar.